Clinical trial exclusion criterion:
Known allergy to local anesthetics (7) Not scheduled for closed reduction with percutaneous pinning under general anesthesia

Entity relations:
- AND("allergy", "local anesthetics")
- AND("closed reduction with percutaneous pinning", "general anesthesia")
- Has_mood("closed reduction with percutaneous pinning", "scheduled for")
- Has_negation("scheduled for", "Not")